Clinical trial exclusion criterion:
Patients with a known diagnosis e.g. upper gastrointestinal cancer

Entity relations:
- Subsumes("known diagnosis", "upper gastrointestinal cancer")